Clinical trial inclusion criterion:
At least 18 years of age at the time of screening

Entity relations:
- Has_value("age", "At least 18 years")